How many copies of TP53 does the elephant genome contain?

20